regular use of tobacco products

The above is a clinical trial exclusion criterion. Annotated with entity spans:
[Multiplier: regular] [Observation: use of tobacco products]